What effect does Methylsulfonylmethane (MSM) have on inflammation?

Methylsulfonylmethane (MSM) exerts anti-inflammatory effects in animal models of inflammation